有關食道先天性異常之敘述，下列何者錯誤？
A. 食道閉鎖（esophageal atresia）最常發生於接近氣管分叉處
B. 食道蹼（esophageal web）除了先天異常的原因外，也可以發生於長期食道逆流的病人身上
C. 食道閉鎖常於長大後才被發現
D. 食道管中，最常見的形式是食道上方為盲端，食道下方與氣管形成管

正確答案：C. 食道閉鎖常於長大後才被發現